關於冠狀動脈繞道手術，下列何者之長期暢通率（long-term patency rate）最差？
A. 右內胸動脈（right internal thoracic artery）
B. 大隱靜脈（greater saphenous vein）
C. 右網膜動脈 (right gastroepiploic artery)
D. 左橈動脈（left radial artery）

正確答案：B. 大隱靜脈（greater saphenous vein）